Clinical trial inclusion criterion:
Measurable metastatic disease as defined by Response Evaluation Criteria in Solid Tumors (RECIST)

Entity relations:
- AND("metastatic disease", "Response Evaluation Criteria in Solid Tumors (RECIST)")